下列有關奎寧（quinine）的敘述，何者錯誤？
A. 以奎寧治療時，病人會產生低血糖的現象，因此必須監測血糖
B. 現今已有對奎寧產生抗藥性的瘧原蟲出現
C. 若使用奎寧後，病人有黑水熱（blackwater fever）的現象，應立即停用奎寧
D. 奎寧對孕婦雖有致使流產的副作用，但是在嚴重的惡性瘧疾時，為顧及媽媽及胎兒的安全，仍應使用奎寧治療

正確答案：C. 若使用奎寧後，病人有黑水熱（blackwater fever）的現象，應立即停用奎寧